Clinical trial inclusion criterion:
6. If a woman of childbearing potential, have a negative urine pregnancy test at Visit 1 and be using an adequate method of birth control throughout the study period.

Entity relations:
- AND("woman", "childbearing potential")
- Has_value("urine pregnancy test", "negative")
- Has_index("at Visit 1", "Visit 1")
- Has_temporal("urine pregnancy test", "at Visit 1")
- Has_qualifier("method of birth control", "adequate")
- Has_index("throughout the study period", "study period")
- Has_temporal("method of birth control", "throughout the study period")